Clinical trial exclusion criterion:
Gelatin allergy

Annotated entities:
- Condition: "allergy"
- Drug: "Gelatin"